Clinical trial inclusion criterion:
Fibroscan within 6 months of Baseline/Day1 with a result of = 12.5 kPa

Entity relations:
- Has_value("Fibroscan", "= 12.5 kPa")
- Has_temporal("Fibroscan", "within 6 months of Baseline/Day1")